Clinical trial inclusion criterion:
At least one of the knee pain VAS score is 40mm or more.

Entity relations:
- Has_value("VAS score", "40mm or more")
- Has_multiplier("knee pain", "At least one")
- AND("knee pain", "VAS score")